Known hypersensitivity to bovine protein

The above is a clinical trial exclusion criterion. Annotated with entity spans:
Known [Condition: hypersensitivity] to [Drug: bovine protein]